Clinical trial exclusion criterion:
Person who is participating in another study or intends to participate in another study during this study duration.

Annotated entities:
- Competing_trial: "Person who is participating in another study or intends to participate in another study during this study duration."